¿Qué alteración padece una persona que cree que sus pensamientos no son suyos sino que se los ha introducido en la mente una fuerza exterior e irresistible?:
1. Idea obsesiva.
2. Idea delirante de negación.
3. Fuga de ideas.
4. Delirio de ser controlado.
5. Eco del pensamiento.

Respuesta correcta: 4. Delirio de ser controlado.